La neurohipófisis:
1. Es una continuación del hipotálamo.
2. Presenta doble control hipotalámico.
3. Recibe hormonas hipotalámicas vía sanguínea.
4. Es irrigada por el sistema porta hipotálamohipofisis.
5. Produce prolactina.

Respuesta correcta: 1. Es una continuación del hipotálamo.